Uno de los elementos característicos del tratamiento cognitivo del Trastorno Obsesivo Compulsivo, es:
1. Que el paciente asuma o admita como normales las interpretaciones y valoraciones disfuncionales que mantiene sobre sus obsesiones.
2. Que el terapeuta se convierta en la principal, y, a ser posible, única fuente de reaseguración para el paciente.
3. Favorecer que el paciente interprete como “ruido” sus obsesiones y pueda “dejarlas ir” sin procesarlas activamente ni buscarles un significado especial.
4. Centrar el foco del tratamiento en los contenidos de las obsesiones para rebatirlos.

Respuesta correcta: 3. Favorecer que el paciente interprete como “ruido” sus obsesiones y pueda “dejarlas ir” sin procesarlas activamente ni buscarles un significado especial.